Clinical trial exclusion criterion:
suspected obstructive choledocholithiasis

Annotated entities:
- Mood: "suspected"
- Condition: "obstructive choledocholithiasis"